下列何種藥物主要是用於治療銅（copper）中毒？
A. dimercaprol
B. penicillamine
C. melarsoprol
D. deferoxamine

正確答案：B. penicillamine